Clinical trial inclusion criterion:
1. Diagnosed with symptomatic sacral perineurial cysts(e.g., lumbosacral or perineal pain, fecal or urinary functions change, sexual function change, lower limb radiation pain, muscle abate, paresthesia, etc)

Entity relations:
- Has_qualifier("sacral perineurial cysts(", "symptomatic")
- Subsumes("sacral perineurial cysts(", "lumbosacral pain")
- OR("lumbosacral pain", "functions change, fecal", "urinary functions change", "sexual function change", "lower limb radiation pain", "muscle abate", "paresthesia", "perineal pain")